known allergy to any of drugs used

The above is a clinical trial exclusion criterion. Annotated with entity spans:
known [Condition: allergy] to any of [Drug: drugs used]